Clinical trial inclusion criterion:
Liver transplant recipients who are 18-65 years of age of a primary liver transplant

Entity relations:
- Has_value("age", "18-65 years")